Clinical trial inclusion criterion:
Subjects undergoing a single level lumbar decompression and fusion

Annotated entities:
- Procedure: "lumbar decompression"
- Procedure: "lumbar fusion"
- Qualifier: "single level"